通常 chromatin 中若有 DNase hypersensitive sites，則代表何種意義？
A. 是屬於 heterochromatin
B. 含有被轉錄之基因
C. 含有 DNase 結合蛋白
D. 和基因的甲基化有關

正確答案：B. 含有被轉錄之基因